Implanted medical devices that are incompatible with MRI imaging.

The above is a clinical trial exclusion criterion. Annotated with entity spans:
Implanted [Device: medical devices] that are [Qualifier: incompatible with MRI imaging].